Clinical trial inclusion criterion:
Fasting blood glucose > 126 mg/dl

Annotated entities:
- Measurement: "Fasting blood glucose"
- Value: "> 126 mg/dl"